Clinical trial inclusion criterion:
4) residual paresis in the lower extremity (Fugl-Meyer LE motor score <34),

Annotated entities:
- Condition: "residual paresis"
- Qualifier: "lower extremity"
- Measurement: "Fugl-Meyer LE motor score"
- Value: "<34"
- Parsing_Error: "4)"